Clinical trial inclusion criterion:
African American race

Entity relations:
- Has_value("race", "African American")